Clinical trial exclusion criterion:
The presence of acute infectious and/or communicable illnesses within 1 month prior to study;

Entity relations:
- Has_qualifier("infectious illnesses", "acute")
- Has_temporal("infectious illnesses", "within 1 month prior to study")
- Has_index("within 1 month prior to study", "study")
- Has_qualifier("communicable illnesses", "acute")
- Has_temporal("communicable illnesses", "within 1 month prior to study")